Clinical trial inclusion criterion:
Age between 31 and 60 years

Entity relations:
- AND("Age", "between 31 and 60 years")